Clinical trial inclusion criteria:
kidney transplant recipient

Annotated entities:
- Procedure: "kidney transplant"